pregnant women

The above is a clinical trial exclusion criterion. Annotated with entity spans:
[Condition: pregnant] [Person: women]